下列有關再生不良性貧血的敘述，何者錯誤？
A. 是一種幹細胞的病變
B. 可能與 T-淋巴細胞反應有關
C. 周邊淋巴球數減低的緣故，病人容易有細菌感染
D. 周邊血液血小板降低，易有出血傾向

正確答案：C. 周邊淋巴球數減低的緣故，病人容易有細菌感染